Clinical trial exclusion criteria:
Patients will be excluded if they have had exposure to a total daily dose of MET 1000 mg bid for at least 2 weeks in the past 3 months;
Patients will be excluded if they could not tolerate MET during the recommended titration schedule outlined in the protocol;
Major neurological or medical illnesses that affect weight gain (e.g., unstable thyroid disease) or require a systemic medication that might impact weight or glucose regulation (e.g., diabetes mellitus [insulin], chronic renal failure [steroids]);
Fasting glucose = 126 mg/dL on 2 occasions during screening indicating need for prompt treatment;
If lab results are available in the last 6 months, then a serum creatinine =1.3 mg/dL on 2 occasions during screening and/or follow-up, indicating potential impairment of renal functioning;
Pregnant or breast feeding;
Children and caregivers who are unable to complete assessments for any reason;

Annotated entities:
- Drug: "MET"
- Multiplier: "1000 mg bid"
- Temporal: "at least 2 weeks in the past 3 months"
- Condition: "not tolerate"
- Drug: "MET"
- Condition: "thyroid disease"
- Qualifier: "unstable"
- Condition: "diabetes mellitus"
- Drug: "insulin"
- Condition: "chronic renal failure"
- Drug: "steroids"
- Measurement: "Fasting glucose"
- Value: "= 126 mg/dL"
- Multiplier: "2 o"
- Measurement: "serum creatinine"
- Value: "=1.3 mg/dL"
- Multiplier: "2"
- Pregnancy_considerations: "Pregnant or breast feeding"
- Informed_consent: "Children and caregivers who are unable to complete assessments for any reason"